Clinical trial exclusion criterion:
chronic pain condition

Annotated entities:
- Condition: "chronic pain condition"